下列有關鼻及鼻竇惡性腫瘤敘述何者正確？
A. 發生性別男女比約為 1：1
B. 硬木屑（hardwood dust）與篩竇腺癌的發生具有特別的關聯性
C. 發生位置最常見於篩竇，其次為上頜竇
D. 以未分化癌佔大多數

正確答案：B. 硬木屑（hardwood dust）與篩竇腺癌的發生具有特別的關聯性